Smoking (current smokers and patients who quit smoking less than six months)

The above is a clinical trial exclusion criterion. Annotated with entity spans:
[Condition: Smoking] ([Temporal: current] [Condition: smokers] and patients who [Condition: quit smoking] [Temporal: less than six months])